El objetivo de utilizar la evaluación económica en la toma de decisiones sobre financiación de medicamentos es:
1. Disminuir el gasto en medicamentos.
2. Ser más eficiente.
3. Ser más eficaz.
4. Utilizar los fármacos más seguros.
5. Utilizar los fármacos con mejor balance beneficio-riesgo.

Respuesta correcta: 2. Ser más eficiente.